Participating in a competing study

The above is a clinical trial exclusion criterion. Annotated with entity spans:
[Non-query-able: Participating in a competing study]